產後 2 週正在哺育母乳的 30 歲女性，因為發燒和右側乳房疼痛至急診處就醫，理學檢查發現右側乳房紅腫且有壓痛的情形，體溫為 38℃，其他生命徵象與理學檢查並無異常，下列敘述何者錯誤？
A. 高度懷疑是產後的乳腺炎（puerperal mastitis）
B. 最常見的致病菌為 Staphylococcus aureus
C. 應全面停止餵母乳
D. 給予口服的抗生素

正確答案：C. 應全面停止餵母乳